Patients who have undergone major surgery (e.g., intra-thoracic, -abdominal, or -pelvic) </= 4 weeks prior to starting study treatment or who have not recovered from such therapy

The above is a clinical trial exclusion criterion. Annotated with entity spans:
Patients who have undergone [Procedure: major surgery] (e.g., [Procedure: intra-thoracic], -abdominal, or -pelvic) [Value: </= 4 weeks prior to starting study treatment] or who have [Negation: not] [Undefined_semantics: recovered from such therapy]